下列何者並非小兒麻痺後期症候群（Post-polio syndrome）的處理方式？
A. 學習節省能量的技巧
B. 增加運動量避免肌肉無力
C. 輔具及支架的使用
D. 減輕體重

正確答案：B. 增加運動量避免肌肉無力